下列那一項不屬於圓錐角膜（keratoconus）的臨床病徵？
A. Munson 氏徵候
B. 高度的不規則性散光
C. Kayser-Fleischer ring
D. 急性角膜積水（acute hydrops）

正確答案：C. Kayser-Fleischer ring